Clinical trial exclusion criterion:
(8)Regular usage of folic acid supplements or compounds containing folic acid in the past 3 months;

Annotated entities:
- Drug: "folic acid supplements"
- Multiplier: "Regular usage"
- Drug: "compounds containing folic acid"
- Temporal: "in the past 3 months"